Clinical trial inclusion criteria:
Patients aged of 18 and over,
Satisfying the 1987 American College of Rheumatology (ACR) criteria for RA
Receiving a prescription of Adalimumab 40 mg subcutaneous every two weeks.

Annotated entities:
- Person: "aged"
- Value: "18 and over"
- Qualifier: "1987 American College of Rheumatology (ACR) criteria"
- Condition: "RA"
- Drug: "Adalimumab"
- Multiplier: "40 mg every two weeks"
- Qualifier: "subcutaneous"